Clinical trial exclusion criterion:
Neuromyelitis optica

Annotated entities:
- Condition: "Neuromyelitis optica"